Clinical trial exclusion criterion:
High amount of magnesium in blood

Annotated entities:
- Value: "High amount"
- Measurement: "magnesium in blood"